Clinical trial inclusion criterion:
Adenocarcinoma of low or moderate differentiation

Annotated entities:
- Condition: "Adenocarcinoma"
- Qualifier: "low or moderate differentiation"